Known hepatic or renal impairment.

The above is a clinical trial exclusion criterion. Annotated with entity spans:
Known [Condition: hepatic] or [Condition: renal impairment].